Clinical trial exclusion criterion:
Weight < 10 kg

Annotated entities:
- Measurement: "Weight"
- Value: "< 10 kg"